Clinical trial exclusion criterion:
Previous low response (less than 3 oocytes on a high dose of FSH stimulation)

Entity relations:
- Has_temporal("low response", "Previous")
- Has_value("oocytes", "less than 3")
- Subsumes("low response", "oocytes")
- Subsumes("low response", "high dose of FSH stimulation")